Clinical trial exclusion criterion:
Patients with peripheral neuropathy

Annotated entities:
- Condition: "peripheral neuropathy"